Ambulatory status (outpatient) at time of consent

The above is a clinical trial inclusion criterion. Annotated with entity spans:
[Visit: Ambulatory status] ([Visit: outpatient]) [Temporal: at time of consent]